Clinical trial exclusion criterion:
history of fetal cytomegalovirus infection

Annotated entities:
- Condition: "cytomegalovirus infection"
- Qualifier: "fetal"